Clinical trial exclusion criterion:
Iloprost cure carried out in the previous month or planned in the following month.

Entity relations:
- Has_temporal("Iloprost", "in the previous month")
- Has_mood("Iloprost", "planned")
- Has_temporal("Iloprost", "in the following month")
- OR("Iloprost", "Iloprost")